Clinical trial inclusion criteria:
History of allergic rhinitis
Wheezing

Annotated entities:
- Condition: "allergic rhinitis"
- Condition: "Wheezing"